Clinical trial inclusion criterion:
either loco-regional or lymph node metastasis

Entity relations:
- OR("loco-regional metastasis", "lymph node metastasis")